Clinical trial exclusion criterion:
Current infectious disease needs antibiotics therapy

Annotated entities:
- Condition: "infectious disease"
- Drug: "antibiotics"